Clinical trial inclusion criteria:
At least 18 years of age at the time of screening
Have stable renal function for one month (30 days) prior to enrollment
Have Chronic HCV infection prior to transplantation with documented HCV viremia = 1,000 IU/ml at screening and either documented HCV Ab positivity or HCV viremia = 1,000 IU/ml at least 6 months prior to enrollment.
Documented genotype 1 HCV infection prior to enrollment and after their transplant in the post-transplantation cohort
HCV disease staging within 12 months prior to enrollment by liver biopsy, transient elastography, or biochemical testing
Be able to give informed consent and comply with study guidelines
Women of childbearing age will be required to have a negative pregnancy test at enrollment and use birth control throughout the duration of treatment.
On the transplant waiting list followed by the University of Maryland's nephrology clinic or the Baltimore VA's nephrology clinic
On chronic hemodialysis not yet on the transplant list and followed in the University's hemodialysis center or in the University's nephrology clinic
Have chronic kidney disease with GFR <50

Annotated entities:
- Person: "age"
- Value: "At least 18 years"
- Measurement: "renal function"
- Value: "stable"
- Temporal: "one month (30 days) prior to enrollment"
- Reference_point: "enrollment"
- Condition: "Chronic HCV infection"
- Temporal: "prior to transplantation"
- Reference_point: "transplantation"
- Measurement: "HCV viremia"
- Value: "= 1,000 IU/ml"
- Measurement: "HCV Ab"
- Value: "positivity"
- Measurement: "HCV viremia"
- Value: "= 1,000 IU/ml"
- Temporal: "at least 6 months prior to enrollment."
- Reference_point: "enrollment"
- Qualifier: "genotype 1"
- Condition: "HCV infection"
- Temporal: "prior to enrollment"
- Temporal: "after their transplant i"
- Reference_point: "enrollment"
- Reference_point: "transplant"
- Procedure: "disease staging"
- Qualifier: "HCV"
- Temporal: "within 12 months prior to enrollment"
- Reference_point: "enrollment"
- Procedure: "liver biopsy"
- Procedure: "transient elastography"
- Procedure: "biochemical testing"
- Informed_consent: "Be able to give informed consent and comply with study guidelines"
- Pregnancy_considerations: "Women of childbearing age will be required to have a negative pregnancy test at enrollment and use birth control throughout the duration of treatment."
- Non-query-able: "On the transplant waiting list followed by the University of Maryland's nephrology clinic or the Baltimore VA's nephrology clinic"
- Procedure: "hemodialysis"
- Qualifier: "chronic"
- Non-query-able: "not yet on the transplant list and followed in the University's hemodialysis center or in the University's nephrology clinic"
- Condition: "chronic kidney disease"
- Measurement: "GFR"
- Value: "<50"